Podemos decir que un evaluador psicológico utiliza indirecta o inferencialmente autoinformes de una persona cuando:
1. De ellos se extrae algo distinto de lo expresado interpretándolo como un indicador de una construcción psicológica.
2. Lo toma de los resultados aportados por otro psicoterapeuta.
3. Pertenecen a información aportada sobre su pasado.
4. Pertenecen a información aportada sobre sus expectativas.
5. El autoinforme tiene un carácter conductual.

Respuesta correcta: 1. De ellos se extrae algo distinto de lo expresado interpretándolo como un indicador de una construcción psicológica.